Clinical trial inclusion criterion:
scheduled for elective cesarean delivery

Annotated entities:
- Qualifier: "elective"
- Procedure: "cesarean delivery"
- Mood: "scheduled for"